人站立時腿部之靜水壓（hydrostatic pressure）會增加。下列那一個因素可防止腿部發生水腫？
A. 增加動脈阻力
B. 降低脈搏壓
C. 增加靜脈壓
D. 降低血管內滲透壓

正確答案：A. 增加動脈阻力